La evaluación del constructo de emoción expresada es especialmente significativa en el tratamiento de la esquizofrenia cuando se aplica la siguiente intervención:
1. Cognitivo conductual de síntomas psicóticos.
2. Entrenamiento en Habilidades Sociales.
3. Intervención familiar.
4. Rehabilitación cognitiva.
5. Rehabilitación laboral.

Respuesta correcta: 3. Intervención familiar.